Clinical trial exclusion criterion:
13. Use of concomitant drugs that prolong QT/QTc interval and/or are CYP3A4 inhibitors are prohibited with the exception of antibiotics, antifungals, and other antimicrobials that are used as standard of care to prevent or treat infections and other such drugs that are considered absolutely essential for the care of the patient.

Annotated entities:
- Condition: "prolong QT/QTc interval"
- Drug: "drugs that prolong QT/QTc interval"
- Drug: "CYP3A4 inhibitors"
- Drug: "antibiotics"
- Drug: "antifungals"
- Drug: "antimicrobials"
- Qualifier: "that prolong QT/QTc interval"
- Negation: "with the exception of"